benign disease

The above is a clinical trial inclusion criterion. Annotated with entity spans:
[Condition: benign disease]